Brain, spinal, ophthalmologic, or major surgery or trauma within the past 90 days other than the elective knee/hip surgery

The above is a clinical trial exclusion criterion. Annotated with entity spans:
[Qualifier: Brain], [Qualifier: spinal], [Qualifier: ophthalmologic], or [Qualifier: major] [Procedure: surgery] or [Condition: trauma] [Temporal: within the past 90 days] [Negation: other than] the [Procedure: elective knee]/hip surgery